General Inclusion

The above is a clinical trial inclusion criterion. Annotated with entity spans:
[Parsing_Error: General Inclusion]